Clinical trial exclusion criterion:
Any condition that in the opinion of study staff would make participation in the study unsafe or interfere with achieving study objectives

Annotated entities:
- Condition: "condition"
- Qualifier: "make participation in the study unsafe"
- Qualifier: "interfere with achieving study objectives"